Clinical trial inclusion criterion:
body mass index < 46 kg/m2

Annotated entities:
- Person: "body mass index"
- Value: "< 46 kg/m2"